造血幹細胞移植前必須先找人類白血球抗原（human leukocyte antigen, HLA）相同的捐贈者，請問：同父同母的兄弟姐妹 HLA 相同的機會是多少？
A. 1/2
B. 1/3
C. 1/4
D. 1/8

正確答案：C. 1/4